Clinical trial exclusion criterion:
Blood transfusion within 4 weeks prior to Screening

Entity relations:
- Has_index("within 4 weeks prior to Screening", "Screening")
- Has_temporal("Blood transfusion", "within 4 weeks prior to Screening")